Clinical trial exclusion criterion:
Moderate to severe pulmonary dysfunction (GOLD II, II, IV)

Annotated entities:
- Qualifier: "Moderate"
- Qualifier: "severe"
- Condition: "pulmonary dysfunction"
- Measurement: "GOLD"
- Value: "II, II, IV"